Las hidrolasas de los lisosomas actúan en medio:
1. Ácido.
2. Básico.
3. Neutro.
4. Depende del material a digerir.
5. A cualquier pH.

Respuesta correcta: 1. Ácido.